Clinical trial exclusion criterion:
Leukemia, lymphomas of any type, melanoma, or other malignant neoplasms affecting the bone marrow or lymphatic systems.

Entity relations:
- multi("affecting the bone marrow", "bone marrow")
- multi("affecting lymphatic systems", "lymphatic systems")
- Has_qualifier("malignant neoplasms", "affecting the bone marrow")
- OR("affecting the bone marrow", "affecting lymphatic systems")
- OR("Leukemia", "lymphomas", "melanoma", "malignant neoplasms")